Other reason indicating mechanical preparation or contradicting it

The above is a clinical trial exclusion criterion. Annotated with entity spans:
Other reason indicating [Procedure: mechanical preparation] or [Condition: contradicting] it